Need for premedication

The above is a clinical trial exclusion criterion. Annotated with entity spans:
[Mood: Need for] [Drug: premedication]